Clinical trial exclusion criterion:
American Society of Anesthesiologist Class 5

Annotated entities:
- Measurement: "American Society of Anesthesiologist Class"
- Value: "5"